Bacterial infection origin from another organ (e.g. pneumonia)

The above is a clinical trial exclusion criterion. Annotated with entity spans:
[Condition: Bacterial infection] origin from [Qualifier: another organ] (e.g. [Condition: pneumonia])